Using one of the following asthma therapies prior to entry into the study: SABA inhaler alone (e.g. salbutamol) on an as required basis and/or Regular non-inhaled corticosteroid (ICS) controller medications for asthma (e.g. cromones or leukotriene receptor antagonists) and/or Previously treated with ICS (equipotent to inhaled budesonide <=400 micrograms (mcg) total daily dose). There must be no ICS use within 2 weeks of Visit 1 (Screening).

The above is a clinical trial inclusion criterion. Annotated with entity spans:
Using one of the following [Procedure: asthma therapies] [Temporal: prior to entry into the study]: [Drug: SABA inhaler] alone (e.g. [Drug: salbutamol]) on an as required basis and/or Regular non-inhaled corticosteroid (ICS) controller medications for asthma (e.g. [Drug: cromones] or [Drug: leukotriene receptor antagonists]) and/or Previously treated with [Drug: ICS] (equipotent to inhaled [Drug: budesonide] [Value: <=400 micrograms (mcg)] total daily dose). There must be [Negation: no] [Procedure: ICS] use [Temporal: within 2 weeks of Visit 1 (Screening)].